Desde el modelo conductual ¿Qué mecanismo de aprendizaje se ha propuesto como principal mecanismo mantenedor del mutismo selectivo?:
1. El refuerzo positivo.
2. El refuerzo negativo.
3. El castigo positivo.
4. El modelado.

Respuesta correcta: 2. El refuerzo negativo.